Patients with type 2 diabetes mellitus

The above is a clinical trial inclusion criterion. Annotated with entity spans:
Patients with [Condition: type 2 diabetes mellitus]